一位 53 歲患有高血壓的男性病患，經抽血檢查發現其空腹血糖值為 180 mg/dL，總膽固醇值（T-CHO）為 260 mg/dL，高密度膽固醇值（HDL-C）為 35 mg/dL，三酸甘油脂值（TG）為 260 mg/dL。按照台灣血脂治療指引，其低密度膽固醇值（LDL-C）控制目標應小於多少 mg/dL？
A. 190
B. 160
C. 130
D. 100

正確答案：D. 100